History of diabetic ketoacidosis, precoma diabetica, or diabetic coma

The above is a clinical trial exclusion criterion. Annotated with entity spans:
[Temporal: History] of [Condition: diabetic ketoacidosis], [Condition: precoma diabetica], or [Condition: diabetic coma]